有關顳葉癲癇（temporal lobe epilepsy）的敘述，下列何者錯誤？
A. 是成人最常見的癲癇症候群（epilepsy syndrome）
B. 癲癇發生區（epileptogenic region）通常和外側顳葉結構（lateral temporal lobe structures）有關
C. 對藥物反應不佳的病人可接受顳葉切除術，大約一半的病人可以在一年後達到癲癇不發作（seizure free）的療效
D. 海馬回硬化（hippocampus sclerosis）是顳葉癲癇主要病因之一

正確答案：B. 癲癇發生區（epileptogenic region）通常和外側顳葉結構（lateral temporal lobe structures）有關